一位 49 歲女性病人因右頸部有 5 × 4 公分硬塊，接受全甲狀腺切除術。病理檢查證實為乳突性甲狀腺癌，同時有頸部淋巴結轉移，手術後病人最適宜之處置為何？
A. 只要服用甲狀腺素
B. 化療且服用甲狀腺素
C. 體外放射治療且服用甲狀腺素
D. 手術後服用放射碘 131I 後，再服用甲狀腺素

正確答案：D. 手術後服用放射碘 131I 後，再服用甲狀腺素